Which miRNA is associated with the circular RNA ciRS-7?

circular RNA-7 (ciRS-7) acts as a sponge of miR-7 and thus inhibits its activity.